Clinical trial inclusion criterion:
Patients of familial cases of POF :

Annotated entities:
- Parsing_Error: "Patients of familial cases of POF :"